Respecto a la prevención de recaídas en el trastorno depresivo mayor, los datos actuales indican que la terapia cognitiva de la depresión de Beck:
1. Es un tratamiento eficaz.
2. Es un tratamiento eficaz sólo si se aplica de forma combinada con medicación antidepresiva.
3. Es un tratamiento menos eficaz que la medicación antidepresiva de continuación.
4. Es un tratamiento que todavía no ha sido examinado en su eficacia en comparación con la medicación antidepresiva de continuación.
5. Es eficaz para el tratamiento agudo del trastorno antidepresivo mayor, pero no para prevenir su recaída.

Respuesta correcta: 1. Es un tratamiento eficaz.